Señale cuál de los siguientes NO es un factor de riesgo de incontinencia urinaria en personas mayores:
1. Función inadecuada del tracto urinario inferior.
2. Hiperactividad del nervio hipogloso.
3. Presencia de barreras arquitectónicas.
4. Deterioro de la movilidad física.

Respuesta correcta: 2. Hiperactividad del nervio hipogloso.